elective thoracotomy

The above is a clinical trial inclusion criterion. Annotated with entity spans:
[Qualifier: elective] [Procedure: thoracotomy]